History of a chronic pain condition

The above is a clinical trial exclusion criterion. Annotated with entity spans:
History of a [Condition: chronic pain] condition